Clinical trial inclusion criterion:
Patient diagnosed by HRCT Core Lab with eligible heterogeneous disease distribution and at least one complete oblique fissure.

Annotated entities:
- Procedure: "HRCT Core Lab"
- Condition: "heterogeneous disease distribution"
- Multiplier: "at least one"
- Condition: "complete oblique fissure"